Parkinson's disease with hallucinations

The above is a clinical trial exclusion criterion. Annotated with entity spans:
[Condition: Parkinson's disease] with [Condition: hallucinations]